pregnant or nursing woman

The above is a clinical trial exclusion criterion. Annotated with entity spans:
[Condition: pregnant] or [Condition: nursing] [Person: woman]